Which type of analysis does DeSeq2 perform?

Both TMM and DESeq2 are widely used for differential gene expression analysis.